Aged at least 18 years

The above is a clinical trial inclusion criterion. Annotated with entity spans:
[Person: Aged] [Value: at least 18 years]